Clinical trial inclusion criterion:
Modified Allen or Barbeau test should be positive (presence of collateral palmar flow).

Annotated entities:
- Measurement: "Modified Allen test"
- Measurement: "Barbeau test"
- Value: "positive"
- Condition: "collateral palmar flow"
- Qualifier: "presence"